Clinical trial exclusion criterion:
7. Known history of chronic viral hepatitis

Annotated entities:
- Parsing_Error: "7."
- Condition: "viral hepatitis"
- Temporal: "chronic"
- Temporal: "history"